Clinical trial inclusion criterion:
Male or female term baby with gestational >37 weeks and postnatal age < or= 28 days

Entity relations:
- Has_value("gestational", ">37 weeks")
- Has_value("postnatal age", "< or= 28 days")
- OR("Male", "female")